Clinical trial exclusion criterion:
NA

Annotated entities:
- Parsing_Error: "NA"